在心搏週期（cardiac cycle）中，血流進入冠狀動脈最主要是在：
A. 肺動脈瓣打開時
B. 左心室收縮時
C. 主動脈瓣關閉時
D. 右心房舒張時

正確答案：C. 主動脈瓣關閉時